Clinical trial inclusion criterion:
Adequate organ function within 14 days of dosing

Annotated entities:
- Condition: "Adequate organ function"
- Temporal: "within 14 days of dosing"
- Reference_point: "dosing"